FIBRO Spect II Index consistent with F0- F2 AND APRI of = 1 during Screening

The above is a clinical trial inclusion criterion. Annotated with entity spans:
[Measurement: FIBRO Spect II Index] consistent with [Value: F0- F2] AND [Measurement: APRI] of [Value: = 1] [Temporal: during Screening]